Clinical trial inclusion criterion:
Breastfed exclusively or predominantly (>50% meals) at inclusion

Annotated entities:
- Condition: "Breastfed"
- Qualifier: "exclusively"
- Qualifier: "predominantly"
- Multiplier: ">50% meals"
- Temporal: "at inclusion"